Clinical trial exclusion criterion:
Known hypersensitivity to rifampin or rifabutin.

Entity relations:
- AND("hypersensitivity", "rifampin")
- OR("rifampin", "rifabutin")